Clinical trial inclusion criterion:
Able to provide written informed consent prior to study participation. .

Entity relations:
- Has_index("prior to study participation", "study participation")
- Has_temporal("written informed consent", "prior to study participation")